Clinical trial inclusion criterion:
Respiratory culture(s) demonstrating evidence of Pseudomonas aeruginosa or Achromobacter species airway infection.

Entity relations:
- Has_value("Respiratory culture(s)", "Pseudomonas aeruginosa")
- OR("Pseudomonas aeruginosa", "Achromobacter species")